Clinical trial exclusion criterion:
No light perception in the affected eye

Entity relations:
- Has_negation("light perception", "No")